一位 30 歲的男性主訴突然於左上方的視野看到閃光，逐漸的呈鋸齒狀，之後越來越大，約 15 分鐘後閃光停止，但是幾分鐘後頭痛就逐漸產生，持續好幾個小時，而且伴隨著噁心感。這是他最近半年來第三次發作。下列何者為最可能的診斷？
A. 癲癇
B. 預兆性偏頭痛
C. 暫時性腦缺血
D. 青光眼

正確答案：B. 預兆性偏頭痛